Clinical trial inclusion criteria:
Male or female =18 years of age at Visit 1
Documentation of a CF diagnosis
Enrolled in the Cystic Fibrosis Foundation National Patient Registry (CFFNPR) prior to Visit 1 (US sites only)
At the time of Visit 1, there is a plan to initiate IV antibiotics for a pulmonary exacerbation
Performed spirometry at Visit 1 and Visit 2 and willing to perform spirometry at Visit 3
Completed the CRISS questionnaire at Visit 1 and Visit 2 and willing to complete the Cystic Fibrosis Respiratory Symptoms Diary (CFRSD) questionnaire at Visit 3
Willing to adhere to a specific treatment duration determined by initial response to treatment and subsequent randomization
Willing to return for follow up Visit 3
Written informed consent obtained from the subject or subject's legal representative

Annotated entities:
- Person: "Male"
- Person: "female"
- Person: "age"
- Value: "=18 years"
- Temporal: "at Visit 1"
- Reference_point: "Visit 1"
- Condition: "CF"
- Observation: "Enrolled in the Cystic Fibrosis Foundation National Patient Registry (CFFNPR)"
- Temporal: "prior to Visit 1"
- Reference_point: "Visit 1"
- Visit: "US sites"
- Drug: "IV antibiotics"
- Condition: "pulmonary exacerbation"
- Temporal: "At the time of Visit 1"
- Reference_point: "Visit 1"
- Procedure: "spirometry"
- Temporal: "at Visit 1"
- Temporal: "at Visit 2"
- Temporal: "at Visit 3"
- Mood: "willing to perform"
- Procedure: "spirometry"
- Reference_point: "Visit 1"
- Reference_point: "Visit 2"
- Reference_point: "Visit 3"
- Procedure: "CRISS questionnaire"
- Temporal: "at Visit 1"
- Temporal: "at Visit 2"
- Reference_point: "Visit 1"
- Reference_point: "Visit 2"
- Mood: "willing to complete"
- Procedure: "Cystic Fibrosis Respiratory Symptoms Diary (CFRSD) questionnaire"
- Temporal: "at Visit 3"
- Reference_point: "Visit 3"
- Mood: "Willing to"
- Non-representable: "adhere to a specific treatment duration determined by initial response to treatment and subsequent randomization"
- Mood: "Willing to"
- Procedure: "follow up Visit 3"
- Observation: "Written informed consent"
- Qualifier: "from the subject"
- Qualifier: "from the subject's legal representative"